Clinical trial inclusion criterion:
Person is willing to comply with study procedures.

Annotated entities:
- Post-eligibility: "Person is willing to comply with study procedures"